Clinical trial inclusion criterion:
Primary ITP according to the definition of Rodeghiero et al. (52) and a platelet count of <30x109/l

Entity relations:
- Has_value("platelet count", "<30x109/l")
- AND("definition of Rodeghiero", "Primary ITP")
- AND("platelet count", "Primary ITP")